Diagnosis of attention-deficit hyperactivity disorder (ADHD) is allowed, provided the patient is not receiving medication(s) known to affect the assessment of RLS.

The above is a clinical trial exclusion criterion. Annotated with entity spans:
Diagnosis of [Condition: attention-deficit hyperactivity disorder] ([Condition: ADHD]) is [Negation: allowed], provided the patient is not receiving medication(s) known to affect the assessment of RLS.